12. Active peptic ulcer or upper gastrointestinal bleeding within the prior 3 months.

The above is a clinical trial exclusion criterion. Annotated with entity spans:
12. [Temporal: Active] [Condition: peptic ulcer] or [Condition: upper gastrointestinal bleeding] [Temporal: within the prior 3 months].